Clinical trial exclusion criterion:
Person who has a score on 10m walk test less than 3km/h (~0.8m/s) (based on 10m walk test conducted during recruiting).

Annotated entities:
- Measurement: "10m walk test"
- Value: "less than 3km/h"
- Value: "0.8m/s)"